La definición “una experiencia sensorial y emocional desagradable asociada con una lesión presente o potencial o descrita en términos de la misma”, ¿a qué concepto hace referencia?:
1. Alodinia.
2. Dolor.
3. Parestesia.
4. Neuralgia.

Respuesta correcta: 2. Dolor.